關於心室調節帶（moderator band）的敘述，何者錯誤？
A. 位於左心室
B. 位於右心室
C. 從心室中隔到前壁
D. 內含房室束的分枝

正確答案：A. 位於左心室